Clinical trial exclusion criterion:
Newborns with severe congenital anomalies

Annotated entities:
- Person: "Newborns"
- Condition: "severe congenital anomalies"